下列有關人類退化性關節炎的復健與治療事項，何者敘述最為正確？
A. 退化性關節炎復健治療的目的是矯正變形
B. 退化性關節炎常發生在承重關節，病患應避免提重物
C. 退化性關節炎最佳的選擇治療方式是人工關節置換
D. 退化性關節炎病患不可從事慢跑活動

正確答案：B. 退化性關節炎常發生在承重關節，病患應避免提重物